Clinical trial exclusion criterion:
vaginal and urinary infection

Entity relations:
- OR("urinary infection", "infection vaginal")